造成慢性肺高壓之原因，最不可能為下列何者？
A. 肺栓塞
B. 慢性阻塞性肺病
C. 左心衰竭
D. 三尖瓣狹窄

正確答案：D. 三尖瓣狹窄